病患因經常輸紅血球，導致產生 allo-antibodies，在臺灣最常見的原因是下列何者？
A. Bombay blood group
B. Anti-Rh E and Rh c
C. Anti-Fya or Fyb
D. Anti-JKa or JKb

正確答案：B. Anti-Rh E and Rh c